Has had prior systemic therapy for HCC in the advanced (incurable) setting other than sorafenib or oxaliplatin-based chemotherapy, prior to start of study medication

The above is a clinical trial exclusion criterion. Annotated with entity spans:
Has had prior [Procedure: systemic therapy] for [Condition: HCC] in the advanced (incurable) setting [Negation: other than] [Qualifier: sorafenib or oxaliplatin-based] [Procedure: chemotherapy], [Temporal: prior] to [Reference_point: start of study medication]